下列何種利尿劑，可用於治療急性肺水腫（acute pulmonary edema），但有耳毒性（ototoxicity）副作用？
A. spironolactone
B. acetazolamide
C. chlorothiazide
D. furosemide

正確答案：D. furosemide